下列何種肺癌之再生期（doubling time）最短？
A. 上皮細胞癌
B. 大細胞癌
C. 腺癌
D. 小細胞癌

正確答案：D. 小細胞癌